Clinical trial exclusion criterion:
Subjects with a current DSM-<U+2163>-TR or 5 diagnosis other than schizophrenia, including schizoaffective disorder, major depressive disorder, bipolar disorder, delirium, dementia, amnesia, Borderline, Paranoid, Histrionic, Schizotypal, Schizoid, Antisocial or other cognitive or personality disorders.

Entity relations:
- Has_negation("schizophrenia", "other than")
- Has_qualifier("cognitive disorders", "other")
- Has_qualifier("schizophrenia", "DSM-<U+2163>-TR")
- Subsumes("schizophrenia", "schizoaffective disorder")
- AND("cognitive disorders", "Borderline disorders")
- AND("cognitive disorders", "Paranoid disorders")
- AND("cognitive disorders", "Histrionic disorders")
- AND("cognitive disorders", "Schizotypal disorders")
- AND("cognitive disorders", "Schizoid disorders")
- AND("cognitive disorders", "Antisocial disorders")
- AND("cognitive disorders", "personality disorders")
- OR("DSM-<U+2163>-TR", "DSM- 5")
- OR("schizoaffective disorder", "Paranoid disorders", "Histrionic disorders", "Schizotypal disorders", "Schizoid disorders", "Antisocial disorders", "cognitive disorders", "personality disorders", "amnesia", "dementia", "delirium", "bipolar disorder", "major depressive disorder", "Borderline disorders")